Absence of documentation of age-appropriate cancer screening at the time of randomization

The above is a clinical trial exclusion criterion. Annotated with entity spans:
Absence of documentation of [Qualifier: age-appropriate] [Procedure: cancer screening] [Temporal: at the time of randomization]